Clinical trial exclusion criterion:
In the use of antibiotics and anti-inflammatories in the last three months;

Annotated entities:
- Drug: "antibiotics"
- Drug: "anti-inflammatories"
- Temporal: "in the last three months"